Clinical trial exclusion criterion:
Seropositivity for human immunodeficiency virus (HIV)

Annotated entities:
- Measurement: "human immunodeficiency virus"
- Measurement: "HIV"
- Value: "Seropositivity"